Teniendo en cuenta la clasificación sanitaria de las vacunas, indique cuál de las siguientes es una vacuna no sistemática:
1. Vacuna antigripal.
2. Vacuna antihepatitis B.
3. Vacuna antipoliomielítica.
4. Vacuna antisarampión.

Respuesta correcta: 1. Vacuna antigripal.